Clinical trial exclusion criterion:
Chronic use of analgesic drugs (more than 3 months)

Entity relations:
- Subsumes("Chronic", "more than 3 months")
- Has_temporal("analgesic drugs", "Chronic")